Clinical trial exclusion criterion:
Significant O2 desaturation (SpO2 < 85%) at rest or during exercise

Annotated entities:
- Qualifier: "Significant"
- Condition: "O2 desaturation"
- Measurement: "SpO2"
- Value: "< 85%"
- Qualifier: "at rest"
- Qualifier: "during exercise"